Clinical trial exclusion criterion:
Moderate or severe COPD exacerbation (requiring corticosteroids or increased dosage of corticosteroids and/or antibiotics or hospitalization) within the 4 weeks prior to Visit 1

Entity relations:
- Has_qualifier("COPD exacerbation", "Moderate")
- Has_qualifier("corticosteroids", "increased dosage")
- AND("corticosteroids", "corticosteroids")
- AND("COPD exacerbation", "corticosteroids")
- Has_temporal("COPD exacerbation", "within the 4 weeks prior to Visit 1")
- Has_index("within the 4 weeks prior to Visit 1", "Visit 1")
- OR("Moderate", "severe")
- OR("corticosteroids", "antibiotics", "hospitalization")